Unable to sign an informed consent

The above is a clinical trial exclusion criterion. Annotated with entity spans:
[Post-eligibility: Unable to sign an informed consent]